Clinical trial inclusion criterion:
Subjects must have normal organ and marrow function as defined below:

Entity relations:
- OR("normal organ function", "normal marrow function")